List proteins with RING domain.

RING1
TRIM proteins
TRAF6 
UHRF1
MARCH7
SINA
BRCA1